Clinical trial inclusion criterion:
Person is walking not slower than 3km/h (~0.8m/s) (based on 10m walk test conducted during recruiting).

Annotated entities:
- Observation: "walking"
- Multiplier: "not slower than 3km/h"